Clinical trial inclusion criterion:
Presents with anxiety (Hamilton Anxiety Rating Scale = 18) at the time of study entry

Entity relations:
- Has_value("Hamilton Anxiety Rating Scale", "= 18")
- AND("anxiety", "Hamilton Anxiety Rating Scale")
- Has_index("at the time of study entry", "time of study entry")
- Has_temporal("anxiety", "at the time of study entry")